Clinical trial exclusion criterion:
Patients unable or unwilling to provide written, informed consent

Annotated entities:
- Post-eligibility: "Patients unable or unwilling to provide written, informed consent"